Clinical trial exclusion criterion:
Parents refusal

Annotated entities:
- Observation: "Parents refusal"